Which is the main epigenetic difference between poised and constitutive enhancers?

Histone H3K27ac separates active from poised enhancers and predicts developmental state.